Clinical trial exclusion criteria:
Unstable angina;
Myocardial infarction and heart surgery up to three months before the survey;
Chronic respiratory diseases;
Hemodynamic instability;
Trauma recent face, nausea and vomiting.
Orthopedic and neurological diseases that may preclude the achievement of the cardiopulmonary test and Cardiac Rehabilitation exercises;
Psychological and / or cognitive impairments that restrict them to respond to questionnaires;

Annotated entities:
- Condition: "Unstable angina"
- Condition: "Myocardial infarction"
- Procedure: "heart surgery"
- Temporal: "up to three months before the survey"
- Condition: "Chronic respiratory diseases"
- Condition: "Hemodynamic instability"
- Condition: "Trauma"
- Condition: "nausea"
- Condition: "vomiting"
- Condition: "neurological diseases"
- Condition: "Orthopedic"
- Qualifier: "preclude the achievement of the cardiopulmonary test and Cardiac Rehabilitation exercises"
- Condition: "cognitive impairments"
- Qualifier: "restrict them to respond to questionnaires"
- Condition: "Psychological impairments"